chronic disease-Immunocompromised

The above is a clinical trial exclusion criterion. Annotated with entity spans:
chronic disease-[Condition: Immunocompromised]